Has a life expectancy of >3 months

The above is a clinical trial inclusion criterion. Annotated with entity spans:
Has a [Observation: life expectancy] of [Value: >3 months]